Clinical trial exclusion criterion:
Patients who have received a live vaccine within 30 days prior to the first dose of trial treatment.

Annotated entities:
- Drug: "live vaccine"
- Temporal: "within 30 days prior to the first dose of trial treatment"
- Reference_point: "the first dose of trial treatment"